Clinical trial inclusion criteria:
Undergoing right upper extremity surgery with supraclavicular block as the primary anesthetic
Age greater than or equal to 18 years of age
American Society of Anesthesiologists (ASA) physical status 1 to 3
Able to give informed consent

Annotated entities:
- Temporal: "Undergoing"
- Procedure: "right upper extremity surgery"
- Procedure: "supraclavicular block"
- Qualifier: "primary anesthetic"
- Person: "Age"
- Value: "greater than or equal to 18 years"
- Measurement: "American Society of Anesthesiologists (ASA) physical status"
- Value: "1 to 3"
- Observation: "Able to give informed consent"